¿En qué consiste el programa cognitivoeducativo de Barsky y colaboradores para el tratamiento de la hipocondría?:
1. En exponerse a la visión de fotografías o vídeos sobre enfermedades y las visitas a enfermos y hospitales.
2. En aprender sobre la percepción de síntomas físicos y sobre los factores psicológicos que amplifican el malestar somático.
3. En hacerse consciente de la función de los síntomas somáticos como mecanismos de manifestación de conflictos subyacentes.
4. En identificar los patrones de funcionamiento familiar que refuerzan la conducta sintomática.
5. En proporcionar de manera reiterada explicaciones médicas tranquilizadoras sobre los síntomas físicos.

Respuesta correcta: 2. En aprender sobre la percepción de síntomas físicos y sobre los factores psicológicos que amplifican el malestar somático.